sedentary or insufficiently active;

The above is a clinical trial inclusion criterion. Annotated with entity spans:
[Observation: sedentary] or [Observation: insufficiently active];